What is herceptin?

Herceptin is a tyrosine-kinase inhibitor that targets the HER2 receptor oncogene with high affinity and activity. It is approved for treatment of breast cancer.